Patients 18 years of age or older with >3 unformed stools/24 hours with positive stool test for C. difficile.

The above is a clinical trial inclusion criterion. Annotated with entity spans:
Patients 18 years of [Person: age] [Value: or older] with [Multiplier: >3] [Observation: unformed stools]/[Temporal: 24 hours] with [Value: positive] [Measurement: stool test] for [Qualifier: C. difficile].